Una reacción exergónica:
1. Es siempre espontánea.
2. Es siempre endotérmica.
3. Se hace a una gran velocidad.
4. G es positiva.
5. Todas son correctas.

Respuesta correcta: 1. Es siempre espontánea.